Clinical trial exclusion criterion:
Anticipated inability to attend scheduled study visits;

Annotated entities:
- Post-eligibility: "Anticipated inability to attend scheduled study visits"